What is caused by SCUBE3 loss of function?

SCUBE3 loss-of-function results in a human disease caused by defective function of a member of the SCUBE family that is associated with a previously unrecognized syndromic disorder. The disorder is characterized by reduced growth, skeletal features, distinctive craniofacial appearance, and dental anomalies. It is also associated with dysregulating bone morphogenetic protein signaling.